Clinical trial inclusion criterion:
Provision of a signed written informed consent

Annotated entities:
- Informed_consent: "Provision of a signed written informed consent"